有一位6歲小女孩在上課時經常發生目光呆滯、凝視等現象，經神經科醫師以腦波檢查發現其腦波中會反覆性的出現spike-wave的波形。初步確認其為一種癲癇症兆，應選用下列何種藥物治療最適宜？
A. Carbamazepine
B. Valproic acid
C. Phenytoin
D. Diazepam

正確答案：B. Valproic acid